De entre las siguientes, la primera célula precursora de los granulocitos neutrófilos es:
1. Monoblasto.
2. Mieloblasto.
3. Metamielocito.
4. Célula en banda (o en cayado)
5. Promielocito.

Respuesta correcta: 2. Mieloblasto.